Clinical trial exclusion criterion:
High-dose statin load <24 hours prior to procedure

Entity relations:
- Has_index("<24 hours prior to procedure", "procedure")
- Has_temporal("High-dose statin", "<24 hours prior to procedure")